Clinical trial exclusion criterion:
the child is enrolled in an ongoing study of Bacillus Calmette Guerin vaccine and is < 2 months old

Annotated entities:
- Competing_trial: "the child is enrolled in an ongoing study of Bacillus Calmette Guerin vaccine and is < 2 months old"